¿Cuál de las siguientes técnicas se utiliza en la terapia cognitiva de la depresión con la finalidad de llevar a la conciencia los procesos de construcción de significados y las disposiciones subyacentes del paciente?:
1. Proyección temporal.
2. Refocalización atencional.
3. Desestructuración de sesgos.
4. Flecha descendente.

Respuesta correcta: 4. Flecha descendente.